有關人類乳突病毒（HPV）的敘述，下列何者錯誤？
A. 病理切片上，koilocytosis是HPV感染的特徵
B. 第6及第11型屬高危險型
C. 第16型是子宮頸癌與癌前病變最常見的型別
D. HPV的E6與E7屬致癌蛋白

正確答案：B. 第6及第11型屬高危險型